Men and women 18 years and older;

The above is a clinical trial inclusion criterion. Annotated with entity spans:
[Person: Men] and [Person: women] [Value: 18 years and older];